Clinical trial exclusion criteria:
Hypersensibility to toxin or excipients
Myastheny
Deglutition's problems
Past medical history of dysphagia or aspiration pneumonia
Pregnancy (positive B-HCG test performed a maxima 72h before) or breastfeeding
Mental , physical incapacity to fill in the questionnaires
Guardianship patients
Skin infections at the inclusion visit
Application in the last 7 days at the site of injection of local treatments (apart emollients or antiseptics) or injections of botulism toxin or dynamic phototherapy or laser in the last 6 months.
Systemic treatment with aminosides in the last 15 days
Inclusion in another study in the last 2 months.

Annotated entities:
- Condition: "Hypersensibility"
- Drug: "toxin"
- Drug: "excipients"
- Condition: "Myastheny"
- Condition: "Deglutition's problems"
- Condition: "dysphagia"
- Temporal: "Past medical history"
- Condition: "aspiration pneumonia"
- Condition: "Pregnancy"
- Measurement: "B-HCG test"
- Value: "positive"
- Observation: "breastfeeding"
- Temporal: "a maxima 72h before"
- Condition: "physical incapacity"
- Condition: "Mental incapacity"
- Procedure: "fill in the questionnaires"
- Non-query-able: "Guardianship patients"
- Condition: "Skin infections"
- Temporal: "at the inclusion visit"
- Visit: "inclusion visit"
- Temporal: "in the last 7 days"
- Procedure: "Application of local treatments"
- Drug: "emollients"
- Drug: "antiseptics"
- Negation: "apart"
- Drug: "botulism toxin"
- Procedure: "injections"
- Procedure: "dynamic phototherapy"
- Procedure: "laser"
- Temporal: "in the last 6 months"
- Procedure: "Systemic treatment"
- Drug: "aminosides"
- Temporal: "in the last 15 days"
- Context_Error: "Inclusion in another study"
- Non-query-able: "Inclusion in another study"
- Post-eligibility: "Inclusion in another study"
- Temporal: "in the last 2 months"
- Procedure: "Inclusion in another study"